Clinical trial exclusion criterion:
Culture-documented or suspected bacterial or viral infection of the upper or lower respiratory tract, sinus or middle ear that is not resolved within 4 weeks of Visit 1 and led to a change in asthma management or, in the opinion of the Investigator, is expected to affect the subject's asthma status or the subject's ability to participate in the study.

Entity relations:
- AND("bacterial infection of the lower respiratory tract", "Culture")
- Has_negation("resolved", "not")
- Has_qualifier("bacterial infection of the lower respiratory tract", "resolved")
- Has_index("within 4 weeks of Visit 1", "Visit 1")
- Has_temporal("bacterial infection of the lower respiratory tract", "within 4 weeks of Visit 1")
- Has_context("bacterial infection of the lower respiratory tract", "change in asthma management")
- AND("change in asthma management", "asthma management")
- OR("bacterial infection of the lower respiratory tract", "viral infection of the sinus", "bacterial infection of the middle ear", "viral infection of the middle ear", "viral infection of the lower respiratory tract", "viral infection of the upper respiratory tract", "bacterial infection of the upper respiratory tract", "bacterial infection of the sinus")
- OR("Culture", "suspected")